3. Patient is participating in another clinical trial which may affect this study's outcomes.

The above is a clinical trial exclusion criterion. Annotated with entity spans:
3. [Post-eligibility: Patient is participating in another clinical trial which may affect this study's outcomes.]